Serum bilirubin > 5.0mg/dl

The above is a clinical trial exclusion criterion. Annotated with entity spans:
[Measurement: Serum bilirubin] [Value: > 5.0mg/d]l